下列有關視網膜小凹（fovea）的敘述，何者錯誤？
A. 位在眼球的後極（posterior pole）
B. 其底部唯有外核層（outer nuclear layer）和感光細胞的外節（outer segment）存在
C. 此處的錐細胞（cones）比桿細胞（rods）多
D. 視覺最清晰

正確答案：B. 其底部唯有外核層（outer nuclear layer）和感光細胞的外節（outer segment）存在